Patients who have non muscle invasive bladder cancer male patients patients between 40-80 years old

The above is a clinical trial inclusion criterion. Annotated with entity spans:
Patients who have [Condition: non muscle invasive bladder cancer] [Person: male] patients patients [Value: between 40-80 years] [Person: old]